En relación al surfactante pulmonar, señale la respuesta correcta:
1. Contiene enzimas necesarias para el intercambio gaseoso.
2. Contribuye a eliminar elementos nocivos en los alvéolos.
3. Es secretada por los neumonitos tipo 1.
4. Disminuye la tensión superficial alveolar.
5. Solo se sintetiza en situaciones de emergencia.

Respuesta correcta: 4. Disminuye la tensión superficial alveolar.